Clinical trial exclusion criteria:
Allergic to study drugs
Antiemetics or steroids use within 24 hrs prior to surgery
Dependence upon opioids
Insulin dependent Diabetes Mellitus
Cardiovascular or pulmonary disease
Renal or hepatic insufficiency
BMI>=35kg/m2
History of motion sickness or PONV
Cigarette smoker
Conversion to open laparotomy from laparoscopic surgery
Pregnants

Annotated entities:
- Condition: "Allergic"
- Drug: "study drugs"
- Drug: "Antiemetics"
- Drug: "steroids use"
- Temporal: "within 24 hrs prior to surgery"
- Reference_point: "surgery"
- Procedure: "surgery"
- Condition: "Dependence upon opioids"
- Qualifier: "Insulin dependent"
- Drug: "Insulin"
- Condition: "Diabetes Mellitus"
- Condition: "Cardiovascular disease"
- Condition: "pulmonary disease"
- Condition: "Renal insufficiency"
- Condition: "hepatic insufficiency"
- Measurement: "BMI"
- Value: ">=35kg/m2"
- Temporal: "History"
- Condition: "motion sickness"
- Condition: "PONV"
- Observation: "Cigarette smoker"
- Observation: "Conversion"
- Procedure: "open laparotomy"
- Procedure: "laparoscopic surgery"
- Condition: "Pregnants"